Clinical trial exclusion criterion:
Females of child bearing potential not using acceptable method of birth control prior to or during study

Entity relations:
- Has_qualifier("method of birth control", "acceptable")
- Has_temporal("method of birth control", "prior to study")
- Has_negation("method of birth control", "not")
- OR("prior to study", "during study")